Clinical trial exclusion criterion:
Current autoimmune disease;

Entity relations:
- Has_temporal("autoimmune disease", "Current")